Respecto a la pérdida de masa ósea en pacientes tratados con glucocorticoides, ¿qué afirmación considera correcta?
1. Si la dosis de prednisona recibida por el paciente, es inferior a 15 mg al día, durante un tiempo inferior a 6 meses, no es un problema realmente y no se debe tomar ninguna medida preventiva.
2. Las tiazidas han demostrado disminuir el riesgo de fracturas, tanto de cadera, como de columna vertebral, en pacientes tratados con glucocorticoides. Por eso, su uso debe recomendarse en estos pacientes como medida preventiva.
3. Se recomienda realizar una densitometría ósea después del primer año de tratamiento con glucocorticoides, puesto que antes no se produce pérdida de masa ósea.
4. Todos los pacientes en tratamiento con glucocorticoides deben recibir un aporte adecuado de calcio y vitamina D, que puede proceder de la dieta o de suplementos farmacológicos.
5. La pérdida de masa ósea se observa, sobre todo, en cadera, por eso la densitometría de columna vertebral no tiene ninguna utilidad en su valoración.

Respuesta correcta: 4. Todos los pacientes en tratamiento con glucocorticoides deben recibir un aporte adecuado de calcio y vitamina D, que puede proceder de la dieta o de suplementos farmacológicos.